Clinical trial exclusion criterion:
Inclusion in another trial without prior agreement with CI

Annotated entities:
- Competing_trial: "Inclusion in another trial without prior agreement with CI"